Clinical trial inclusion criterion:
18 years or older

Annotated entities:
- Value: "18 years or older"
- Person: "older"